Clinical trial inclusion criterion:
Have a planned surgical procedure or clinical situation that would allow objective neuromuscular monitoring techniques to be applied with access to the arm for neuromuscular transmission monitoring.

Entity relations:
- multi("that would allow objective neuromuscular monitoring techniques to be applied", "objective neuromuscular monitoring techniques")
- Has_qualifier("surgical procedure", "that would allow objective neuromuscular monitoring techniques to be applied")
- Has_mood("surgical procedure", "planned")
- OR("surgical procedure", "clinical situation")